Clinical trial exclusion criterion:
Unable to read and understand the Danish language or to give informed consent

Annotated entities:
- Observation: "Unable to read"
- Observation: "Unable to understand the Danish language"
- Observation: "Unable to give informed consent"